一位頭部外傷病人之理學檢查如下：受疼痛刺激，眼睛會睜開。病人不會言語和出聲。受疼痛刺激，左上肢不會動，右上肢則會不正常伸張（abnormal extension），則其昏迷指數（Glasgow coma scale, GCS）為多少？
A. 3
B. 4
C. 5
D. 6

正確答案：C. 5